Clinical trial exclusion criterion:
The presence of respiratory, cardio-vascular insufficiency, impaired liver and kidney function, established during a physical examination at visit number 1;

Annotated entities:
- Condition: "cardio-vascular insufficiency"
- Condition: "respiratory insufficiency"
- Condition: "impaired liver"
- Condition: "impaired kidney function"
- Temporal: "at visit number 1"